Clinical trial exclusion criterion:
History of pancreatitis

Annotated entities:
- Temporal: "History"
- Condition: "pancreatitis"